Clinical trial exclusion criterion:
Clinically significant out of range values of serum levels of either alanine aminotransferase (ALT), aspartate aminotransferase (AST) or alkaline phosphatase (ALP) in the Investigator's opinion.

Annotated entities:
- Qualifier: "Clinically significant"
- Value: "out of range values"
- Measurement: "alanine aminotransferase (ALT)"
- Measurement: "aspartate aminotransferase (AST)"
- Measurement: "alkaline phosphatase (ALP)"